Clinical trial exclusion criterion:
History of statin intolerance with drug interaction to antiretroviral drugs.

Annotated entities:
- Condition: "intolerance"
- Drug: "statin"
- Drug: "antiretroviral drugs"